Clinical trial inclusion criterion:
Male or female >18 years of age at the time of screening

Annotated entities:
- Person: "Male"
- Person: "female"
- Value: ">18 years of age"
- Person: "age"
- Temporal: "at the time of screening"
- Reference_point: "the time of screening"